做皮下切片（skin snips）檢查微絲蟲（microfilaria）是診斷下列何種寄生蟲感染的重要依據？
A. 羅阿絲蟲（Loa loa）
B. 蟠尾絲蟲（Onchocerca volvulus）
C. 麥地那線蟲（Dracunculus medinensis）
D. 馬來亞絲蟲（Brugia malayi）

正確答案：B. 蟠尾絲蟲（Onchocerca volvulus）